What is the gold standard treatment for Iatrogenic male incontinence?

The artificial urethral sphincter has represented, until today, the gold standard but, in the recent years, sling systems have been investigated as minimally invasive alternative options.